Clinical trial exclusion criterion:
Brain trauma or neurosurgery;

Entity relations:
- OR("Brain trauma", "neurosurgery")